王先生因肺炎住院，經檢	為綠膿桿菌（Pseudomonas aeruginosa）感染所引起，下列何者為 antipseudomonal penicillin，可以和 aminoglycoside合併治療以加強療效？
A. ampicillin
B. nafcillin
C. ticarcillin
D. penicillin G

正確答案：C. ticarcillin